Clinical trial inclusion criterion:
Medical history, if applicable (natural menopause at least 12 months prior to first study drug administration; or surgical menopause by bilateral ovariectomy at least 3 months prior to first study drug administration), in addition: in women < 65 years old, follicle stimulating hormone (FSH) > 40 IU/L

Annotated entities:
- Condition: "natural menopause"
- Temporal: "at least 12 months prior to first study drug administration"
- Reference_point: "first study drug administration"
- Condition: "surgical menopause"
- Procedure: "bilateral ovariectomy"
- Temporal: "at least 3 months prior to first study drug administration"
- Reference_point: "first study drug administration"
- Value: "< 65 years"
- Person: "years old"
- Measurement: "follicle stimulating hormone (FSH)"
- Value: "> 40 IU/L"
- Person: "women"